Clinical trial inclusion criterion:
Presence of sustained ventricular tachycardia with HR> 120 bpm

Annotated entities:
- Qualifier: "sustained"
- Condition: "ventricular tachycardia"
- Measurement: "HR"
- Value: "> 120 bpm"